Concurrent terminal illness or other severe disease (e.g., active neoplasm) or other significant laboratory value(s) which, in the opinion of the investigator, could preclude participation or survival

The above is a clinical trial exclusion criterion. Annotated with entity spans:
[Temporal: Concurrent] [Condition: terminal illness] or [Qualifier: other] [Condition: severe disease] (e.g., [Qualifier: active] [Condition: neoplasm]) or other [Condition: significant laboratory value(s)] [Non-representable: which, in the opinion of the investigator, could preclude participation or survival]